Clinical trial exclusion criterion:
History of other chronic neurological illnesses that might mimic MS with chronic or intermittent symptoms (i.e. ALS, myasthenia gravis, chronic neuropathy, etc.)

Annotated entities:
- Condition: "chronic neurological illnesses"
- Temporal: "History of"
- Qualifier: "mimic MS"
- Condition: "ALS"
- Condition: "myasthenia gravis"
- Condition: "chronic neuropathy"